What is the indication for KYMRIAH?

Kymriah™ has been approved for the treatment of pediatric patients and young adults with refractory or relapse (R/R) B cell precursor acute lymphoblastic leukemia.